Clinical trial exclusion criterion:
Allergy to methadone

Entity relations:
- AND("Allergy", "methadone")